Patient fulfils DSM-IV and NINCDS-ADRA criteria for probable Alzheimers disease

The above is a clinical trial inclusion criterion. Annotated with entity spans:
Patient [Value: fulfils] [Measurement: DSM-IV] and [Measurement: NINCDS-ADRA criteria] for [Mood: probable] [Condition: Alzheimers disease]